Contraindication for adalimumab

The above is a clinical trial exclusion criterion. Annotated with entity spans:
[Condition: Contraindication] for [Drug: adalimumab]